關於玫瑰糠疹（pityriasis rosea）的敘述，下列何者錯誤？
A. 病灶存在時間常小於一週
B. 常可見先驅病灶（herald patch）
C. 典型表徵呈現聖誕樹樣分布（Christmas tree pattern）
D. 鑑別診斷包括二期梅毒（secondary syphilis）

正確答案：A. 病灶存在時間常小於一週